Previous surgical or catheter ablation for atrial fibrillation

The above is a clinical trial exclusion criterion. Annotated with entity spans:
[Temporal: Previous] surgical or [Procedure: catheter ablation] for [Condition: atrial fibrillation]